Clinical trial exclusion criterion:
Uncontrolled bleeding tendency (prothrombin conc. Less than 70%)

Entity relations:
- Has_qualifier("bleeding tendency", "Uncontrolled")
- Has_value("prothrombin", "Less than 70%")